Clinical trial inclusion criterion:
over 18 years of age

Annotated entities:
- Value: "over 18 years"
- Person: "age"